Clinical trial exclusion criterion:
Use of neuroleptics

Annotated entities:
- Drug: "neuroleptics"